planned surgical duration more than 3 hours

The above is a clinical trial exclusion criterion. Annotated with entity spans:
[Measurement: planned surgical duration] [Value: more than 3 hours]